Clinical trial exclusion criterion:
Female patients who are pregnant or breastfeeding before or during the three-year follow-up

Annotated entities:
- Pregnancy_considerations: "Female patients who are pregnant or breastfeeding before or during the three-year follow-up"